Clinical trial exclusion criterion:
5. Are not scheduled to undergo conventional ultrasound

Annotated entities:
- Negation: "not"
- Mood: "scheduled"
- Procedure: "conventional ultrasound"